Clinical trial exclusion criterion:
Previous large bowel/rectal surgery

Entity relations:
- OR("large bowel surgery", "rectal surgery")